有關真菌菌絲的描述，下列何者錯誤？
A. 菌絲長度因不同條件下生長而異
B. 能產生孢子的菌絲稱為營養菌絲
C. 菌絲形態可作為鑑別真菌的依據
D. 菌絲斷裂是真菌的繁殖方式之一

正確答案：B. 能產生孢子的菌絲稱為營養菌絲